Clinical trial exclusion criterion:
Patients with a history of bladder cancer or patients with active bladder cancer

Entity relations:
- Has_qualifier("bladder cancer", "active")
- OR("bladder cancer", "bladder cancer")